1. Patient or relatives unable or unwilling to give informed consent

The above is a clinical trial exclusion criterion. Annotated with entity spans:
[Parsing_Error: 1.] [Non-query-able: Patient or relatives unable or unwilling to give informed consent]